Clinical trial exclusion criterion:
14. Use of experimental or unapproved immunosuppressant

Annotated entities:
- Parsing_Error: "14."
- Drug: "immunosuppressant"
- Qualifier: "unapproved"
- Qualifier: "experimental"
- Undefined_semantics: "experimental or unapproved"
- Context_Error: "experimental or unapproved"